構成真菌細胞壁之主要成分為何？
A. 幾丁質（Chitin）以及 α-1-4-葡萄聚醣（α-1-4-glucan）
B. 幾丁質以及 β-1-3-葡萄聚醣（β-1-3-glucan）
C. 肽醣（Peptidoglycan）以及 β-1-4-葡萄聚醣
D. 幾丁質以及 α-1-6-葡萄聚醣（α-1-6-glucan）

正確答案：B. 幾丁質以及 β-1-3-葡萄聚醣（β-1-3-glucan）